¿Cuál de estas especies es un radical libre?
1. La molécula NO.
2. La molécula O2.
3. La molécula N2O.
4. El anión OH-.
5. El anión ClO-.

Respuesta correcta: 1. La molécula NO.